Patients with fibromyalgia or chronic pain syndromes such as rheumatoid arthritis, osteoarthritis, or lupus.

The above is a clinical trial exclusion criterion. Annotated with entity spans:
Patients with [Condition: fibromyalgia] or [Condition: chronic pain syndromes] such as [Condition: rheumatoid arthritis], [Condition: osteoarthritis], or [Condition: lupus].